Clinical trial exclusion criterion:
Women of child-bearing potential, who are biologically able to conceive, not employing two forms of highly effective contraception or who are pregnant.

Annotated entities:
- Person: "Women"
- Condition: "child-bearing potential"
- Condition: "biologically able to conceive"
- Multiplier: "two"
- Device: "highly effective contraception"
- Condition: "pregnant"
- Negation: "not"